Clinical trial inclusion criterion:
Eastern Cooperative Oncology Group (ECOG) performance status of 0 - 2

Annotated entities:
- Measurement: "Eastern Cooperative Oncology Group performance status"
- Measurement: "ECOG"
- Value: "0 - 2"